2. Subject requires single- or multi-vessel percutaneous coronary intervention (PCI) of de novo or restenotic target lesion (including in-stent restenotic lesions).

The above is a clinical trial inclusion criterion. Annotated with entity spans:
2. Subject requires [Qualifier: single-] or [Qualifier: multi-vessel] [Procedure: percutaneous coronary intervention (PCI)] of [Qualifier: de novo] or [Qualifier: restenotic] [Condition: target lesion] (including [Condition: in-stent restenotic lesions]).